Tras el reconocimiento antigénico, el receptor de la célula T transmite una señal de activación a través de:
1. CD3 y cadena .
2. Ig e Ig.
3. TAP1 y TAP2.
4. RAG1 y RAG2.
5. Regiones determinantes de la complementariedad 1 y 2.

Respuesta correcta: 1. CD3 y cadena .